關於肺炎鏈球菌（Streptococcus pneumoniae）的敘述，下列何者錯誤？
A. 所產生的莢膜（capsule）能抵抗吞噬作用（phagocytosis）
B. 此菌於肺泡腔（alveolar spaces）大量生長，可造成肺炎（pneumonia）
C. 透過台口酸（teichoic acid）和胜肽聚醣（peptidoglycan）碎片，可誘發替代型補體活化路徑（alternative complement pathway）
D. 多價疫苗（polyvalent vaccine）是由常見的血清型菌株所產生的體表蛋白質（surface proteins）所製備的

正確答案：D. 多價疫苗（polyvalent vaccine）是由常見的血清型菌株所產生的體表蛋白質（surface proteins）所製備的